En un codón de iniciación de la traducción:
1. AUG.
2. UAU.
3. UAG.
4. UGA.

Respuesta correcta: 1. AUG.